Clinical trial inclusion criterion:
one additional cytotoxic regimen and/or PARP inhibitor for management of recurrent or persistent disease.

Entity relations:
- Has_multiplier("cytotoxic regimen", "one additional")
- Has_temporal("disease", "recurrent")
- AND("cytotoxic regimen", "disease")
- OR("cytotoxic regimen", "PARP inhibitor")
- OR("recurrent", "persistent")